橫膈（diaphragm）上的主動脈裂口（aortic hiatus）通過下列何種結構？
A. 迷走神經
B. 膈神經
C. 交感神經幹
D. 胸管

正確答案：D. 胸管